Clinical trial exclusion criterion:
Patients with previous permanent upper face fillers injection

Entity relations:
- Has_qualifier("permanent fillers injection", "upper face")